下列關於血型糖蛋白（glycophorin）之敘述，何者錯誤？
A. 它是紅血球胞膜上的一種鑲嵌穿膜蛋白質（integral membrane protein）
B. 其寡糖連接在該蛋白質之細胞質面（cytoplasmic face）的胺基酸殘基上
C. 它含有一個由非極性胺基酸組成的胜肽片段所形成的穿膜螺旋
D. 血型糖蛋白上帶有決定人類ABO血型的寡糖

正確答案：B. 其寡糖連接在該蛋白質之細胞質面（cytoplasmic face）的胺基酸殘基上